Clinical trial exclusion criterion:
allergy to study drugs

Entity relations:
- AND("allergy", "study drugs")